Clinical trial inclusion criteria:
Rotator cuff tear patients undergoing arthroscopic rotator cuff tear

Annotated entities:
- Condition: "Rotator cuff tear"
- Procedure: "arthroscopic rotator cuff tear"